Clinical trial exclusion criterion:
History of adverse reaction to a-2 adrenergic agonists

Annotated entities:
- Condition: "adverse reaction"
- Drug: "a-2 adrenergic agonists"